En los reflejos espinales:
1. Monosinápticos intervienen interneuronas.
2. Las interneuronas forman la vía final común.
3. Las neuronas sensitivas entran en la médula por la parte dorsal.
4. Las motoneuronas gamma inervan las fibras del músculo esquelético.

Respuesta correcta: 3. Las neuronas sensitivas entran en la médula por la parte dorsal.